Be willing to participate in a smoking cessation program

The above is a clinical trial inclusion criterion. Annotated with entity spans:
Be [Mood: willing to participate] in a [Procedure: smoking cessation program]